Clinical trial exclusion criterion:
Women who are pregnant, nursing, or who plan to become pregnant while in the trial.

Annotated entities:
- Pregnancy_considerations: "Women who are pregnant, nursing, or who plan to become pregnant while in the trial."